PCOS diagnosis based on 2003 Rotterdam criteria

The above is a clinical trial inclusion criterion. Annotated with entity spans:
[Condition: PCOS] diagnosis based on [Qualifier: 2003 Rotterdam criteria]